Severe Renal dysfunction (Ccr<30 ml/min)

The above is a clinical trial exclusion criterion. Annotated with entity spans:
[Qualifier: Severe] [Condition: Renal dysfunction] ([Measurement: Ccr][Value: <30 ml/min])